Clinical trial exclusion criterion:
History of neurologic deficit.

Entity relations:
- Has_temporal("neurologic deficit", "History")